Clinical trial inclusion criteria:
adult female partner
aged 18 to 40 years.
scheduled for elective cesarean section.

Annotated entities:
- Person: "adult"
- Person: "female"
- Observation: "female partner"
- Person: "aged"
- Value: "18 to 40 years"
- Procedure: "cesarean section"
- Qualifier: "elective"
- Mood: "scheduled for"